Patients who are primarily managed and regularly followed-up by a cardiologist for their HF

The above is a clinical trial exclusion criterion. Annotated with entity spans:
[Non-query-able: Patients who are primarily managed and regularly followed-up by a cardiologist for their HF]